Clinical trial inclusion criterion:
General state with Karnowsky greater than 80, ECOG = 0, 1 or 2.

Annotated entities:
- Measurement: "Karnowsky"
- Value: "greater than 80"
- Measurement: "ECOG"
- Value: "0, 1 or 2"